Persons referred to in Articles L1121-5 to L1121-8 of the French Public health Code: pregnant woman, parturient, nursing mother, person deprived of liberty by judicial or administrative decision, person subject to a legal protection measure, can not Be included in clinical trials.

The above is a clinical trial exclusion criterion. Annotated with entity spans:
[Context_Error: Persons referred to in Articles L1121-5 to L1121-8 of the French Public health Code]: [Condition: pregnant] [Person: woman], [Condition: parturient], [Condition: nursing] mother, person [Observation: deprived of liberty] by judicial or administrative decision, person [Observation: subject to a legal protection] measure, can not Be included in clinical trials.